下列關於 JRA（Juvenile rheumatoid arthritis）三種 subtypes 的敘述，何者正確？
A. Pauciarticular onset 合併 uveitis 較常發生在女孩身上
B. Polyarticular onset 是最常見的型態
C. 最常發作的年齡介於 4～6 歲間
D. Polyarticular onset 流行率，男孩和女孩一樣多

正確答案：A. Pauciarticular onset 合併 uveitis 較常發生在女孩身上